Clinical trial exclusion criterion:
Pregnancy

Annotated entities:
- Pregnancy_considerations: "Pregnancy"